Clinical trial exclusion criterion:
coronary artery disease

Annotated entities:
- Condition: "coronary artery disease"